Clinical trial exclusion criterion:
Cognitive impairment according to MiniCog

Entity relations:
- AND("MiniCog", "Cognitive impairment")